Clinical trial exclusion criterion:
Patients with chronic conditions that would limit our ability to develop the study according to objectives, such as neurodevelopmental conditions preventing patients from understanding the Oucher tool

Annotated entities:
- Condition: "chronic conditions"
- Condition: "neurodevelopmental conditions"
- Observation: "understanding the Oucher tool"
- Condition: "preventing"
- Observation: "limit our ability to develop the study according to objectives"